Clinical trial exclusion criterion:
HPN < 12 months

Annotated entities:
- Measurement: "HPN"
- Value: "< 12 months"